Individuals will be excluded from enrollment if, at the time of enrollment, their M. tuberculosis isolate is already known to be resistant to any of the study drugs.

The above is a clinical trial exclusion criterion. Annotated with entity spans:
Individuals will be excluded from enrollment if, at the time of enrollment, their [Condition: M. tuberculosis isolate] is already known to be [Qualifier: resistant to any of the study drugs].